下列何種運送方式需要能量？
A. simple diffusion
B. facilitated diffusion
C. osmosis
D. secondary active transport

正確答案：D. secondary active transport